En la electroforesis de hemoglobina en acetato de celulosa:
1. Se emplean como colorantes el Rojo Neutro o el Azul de Evans.
2. Se obtienen tres fracciones diferenciadas: Hb A, Hb A2 y anhidrasa carbónica.
3. La fracción mayoritaria es la HbA2.
4. Se obtiene el hemolizado empleando CINH4.
5. Se emplea como decolorante Acetona-Etanol (1:1).

Respuesta correcta: 2. Se obtienen tres fracciones diferenciadas: Hb A, Hb A2 y anhidrasa carbónica.